Clinical trial exclusion criterion:
Ulcer infection

Annotated entities:
- Condition: "Ulcer infection"